關於聽小骨之敘述，下列何者錯誤？
A. 鎚骨（malleus）接在鼓膜（tympanic membrane）
B. 砧骨（incus）與鎚骨（malleus）之間互相關節
C. 鐙骨（stapes）接到卵圓窗（oval window）
D. 鼓膜張肌（tensor tympani muscle）的肌腱附	在砧骨（incus）

正確答案：D. 鼓膜張肌（tensor tympani muscle）的肌腱附	在砧骨（incus）